What happens upon disruption of a TAD boundary?

Disruption of a TAD boundary causes ectopic chromosomal contacts and long-range transcriptional misregulation.